Clinical trial exclusion criterion:
participant taken an opioid or an opioid like analgesic within 24 hours

Annotated entities:
- Drug: "opioid"
- Drug: "opioid like analgesic"
- Temporal: "within 24 hours"